目前臺灣結核病之防治措施最重要的是下列那一項？
A. 全面痰液篩檢，找出新病人
B. 找出最常見之抗藥菌株
C. 發現新病人，並配合實施都治（DOTS）計畫
D. 增加預算，擴編醫院

正確答案：C. 發現新病人，並配合實施都治（DOTS）計畫